Clinical trial inclusion criterion:
aged between 20 and 80

Annotated entities:
- Person: "aged"
- Value: "between 20 and 80"